Symptomatic, permanent AF of at least three months duration

The above is a clinical trial inclusion criterion. Annotated with entity spans:
[Qualifier: Symptomatic], [Qualifier: permanent] [Condition: AF] of [Multiplier: at least three months duration]